Clinical trial exclusion criterion:
Metastatic tumor

Entity relations:
- Has_qualifier("tumor", "Metastatic")